一位 55 歲男性因為上腹痛合併發燒畏寒至急診，初步檢驗顯示WBC：13600/mm3，seg：89%，bilirubin （total）：6.0 mg/dL，腹部超音波檢查顯示有總膽管結石，則下列敘述何者錯誤？
A. 理學檢查可能摸到膽囊
B. 患者血中 AST/ALT 可上升，但絕不會超過 5 倍
C. 血液培養可能有革蘭氏陰性菌
D. 內視鏡治療為取石之首選

正確答案：B. 患者血中 AST/ALT 可上升，但絕不會超過 5 倍